分析一個腎臟癌病人的腫瘤時，發現有延胡索酸酵素（fumarase）基因突變，下列敘述何者正確？
A. 延胡索酸（fumarate）因而會在腫瘤組織中大幅下降
B. 缺氧性誘導轉錄因子（hypoxia inducible transcription factor-1, HIF-1）會跟	下降
C. 缺氧性誘導轉錄因子（hypoxia inducible transcription factor-1, HIF-1）會刺激多種糖解酵素（glycolytic enzymes）的產生
D. 缺氧性誘導轉錄因子（hypoxia inducible transcription factor-1, HIF-1）會抑制血管生成（angiogenesis）

正確答案：C. 缺氧性誘導轉錄因子（hypoxia inducible transcription factor-1, HIF-1）會刺激多種糖解酵素（glycolytic enzymes）的產生